Clinical trial exclusion criterion:
Bone marrow disease

Annotated entities:
- Condition: "Bone marrow disease"